一位25歲女性，今早開始下腹疼痛逐漸加劇，並有陰道出血的情形，來急診就診時，生命徵象如下：血壓 mmHg，脈搏130次/分鐘，呼吸22次/分鐘，體溫36.5℃。過去並無特殊病史，最後一次正常月經約7 週以前，下列處置何者較不適當？
A. 安排懷孕檢測
B. 病人可以清楚表達不適，依照急救處理原則，給予O2、IV、Monitor
C. 可能是低血容性休克，給予大量輸液，並考慮予以輸血
D. 心電圖監視器顯示竇性頻脈（sinus tachycardia），病人血壓低有休克現象，可考慮給予100焦耳的同步電擊

正確答案：D. 心電圖監視器顯示竇性頻脈（sinus tachycardia），病人血壓低有休克現象，可考慮給予100焦耳的同步電擊